Clinical trial inclusion criterion:
Normal cognitive status according to MiniCog

Annotated entities:
- Procedure: "MiniCog"
- Condition: "Normal cognitive status"